Physicians Global Assessment score of 3 or 4 at baseline

The above is a clinical trial inclusion criterion. Annotated with entity spans:
[Measurement: Physicians Global Assessment score] of [Value: 3] or [Value: 4] [Temporal: at baseline]